下列有關中毒情況與所使用解毒劑之配對，何者錯誤？
A. methanol---folinate
B. lead encephalopathy---dimercaprol + edetate calcium disodium
C. organophosphorus compounds---physostigmine
D. cyanide---sodium thiosulfate

正確答案：C. organophosphorus compounds---physostigmine